Clinical trial exclusion criterion:
Severe liver or renal disease.

Entity relations:
- Has_qualifier("renal disease", "Severe")
- OR("renal disease", "disease liver")